Clinical trial exclusion criterion:
oxycodone contraindicated

Annotated entities:
- Drug: "oxycodone"
- Condition: "contraindicated"